Clinical trial exclusion criterion:
chronic, metabolic, systemic and endocrine disorders, including hyperandrogenism, hyperprolactinemia, diabetes mellitus and thyroid disease,

Annotated entities:
- Condition: "chronic disorders"
- Condition: "metabolic disorders"
- Condition: "systemic disorders"
- Condition: "endocrine disorders"
- Condition: "hyperandrogenism"
- Condition: "hyperprolactinemia"
- Condition: "diabetes mellitus"
- Condition: "thyroid disease"